5. HIV-negative as determined by a HIV rapid test at time of enrollment

The above is a clinical trial inclusion criterion. Annotated with entity spans:
5. [Condition: HIV-negative] as determined by a [Measurement: HIV rapid test] [Temporal: at time of enrollment]